52歲女性，全身倦怠、食慾不振，血中肌酸酐（creatinine）11.2 mg/dL，決定接受腎臟替代療法，目前下列何種治療有最差之5年存活率？
A. HLA相符腎臟移植
B. HLA不相符腎臟移植
C. ABO血型不相符腎臟移植
D. 血液透析

正確答案：D. 血液透析